Clinical trial exclusion criterion:
Diagnosed or suspected malignant tumor;

Annotated entities:
- Condition: "malignant tumor"
- Mood: "suspected"
- Mood: "Diagnosed"